60 歲女性，主訴過去數星期以來經常有頭痛及暈眩現象。病人無發燒，但臉色紅潤而有多血或稍微發紺，病人血壓正常，脾臟可觸摸到。血色素、血容積比、血小板及白血球皆明顯升高。血清中促紅細胞生成素（erythropoietin）無法偵測到，鐵蛋白（ferritin）正常。下列何者為病人較常經歷的病程？
A. 病人最後多因轉化成急性淋巴母細胞白血病（acute lymphoblastic leukemia）而死亡
B. 病人最後多因轉化成急性髓母細胞白血病（acute myeloblastic leukemia）而死亡
C. 發生骨髓纖維化，而在脾臟有顯著的髓外造血（extramedullary hematopoiesis）
D. 病人常可不經任何治療而自然獲得緩解

正確答案：C. 發生骨髓纖維化，而在脾臟有顯著的髓外造血（extramedullary hematopoiesis）